Patients posing a serious suicidal risk and/or violence as judged by the investigator;

The above is a clinical trial exclusion criterion. Annotated with entity spans:
Patients posing a serious [Observation: suicidal risk] and/or [Observation: violence] as judged by the investigator;